¿Cuál de los siguientes elementos resulta ser una excepción en cuanto a su configuración electrónica del estado fundamental?
1. V.
2. Fe.
3. Co.
4. Cr.

Respuesta correcta: 4. Cr.